Clinical trial exclusion criterion:
Female subjects who are pregnant or breast-feeding or considering becoming pregnant during the study

Annotated entities:
- Pregnancy_considerations: "Female subjects who are pregnant or breast-feeding or considering becoming pregnant during the study"